What is Cellbase?

CellBase is a comprehensive collection of RESTful web services for retrieving relevant biological information from heterogeneous sources.